Clinical trial inclusion criterion:
Patients with 7.0% = HbA1c = 11.0% at the screening visit

Annotated entities:
- Measurement: "HbA1c"
- Value: "7.0% 11.0%"
- Temporal: "at the screening visit"
- Reference_point: "screening"